Clinical trial inclusion criterion:
Moderate to severe rheumatoid arthritis

Entity relations:
- Has_qualifier("rheumatoid arthritis", "Moderate to severe")